Clinical trial exclusion criterion:
Other reason indicating mechanical preparation or contradicting it

Annotated entities:
- Procedure: "mechanical preparation"
- Condition: "contradicting"